Patients eligible for PCI with application of DES, due to ACS.

The above is a clinical trial inclusion criterion. Annotated with entity spans:
Patients eligible for [Procedure: PCI] with application of [Procedure: DES], due to [Condition: ACS].